Patient treated with immunosuppressive within 1 month before study inclusion.

The above is a clinical trial exclusion criterion. Annotated with entity spans:
Patient treated with [Drug: immunosuppressive] [Temporal: within 1 month before study inclusion].